Los fármacos que son eliminados por excreción renal mediante filtración glomerular presentan un coeficiente de extracción renal:
1. Menor que 0,3.
2. Entre 0,3 y 0,7.
3. Mayor que 0,7.
4. Mayor que 1.

Respuesta correcta: 1. Menor que 0,3.